Clinical trial exclusion criteria:
History of organic brain disease
DSM-IV diagnosis of Alcohol or Substance Dependence within the last six months (except nicotine) or DSM-5 diagnosis of Substance Use Disorder in the last six months (except nicotine)
DSM-IV diagnosis of Alcohol or Substance Abuse within the last one month (except nicotine) or DSM-5 diagnosis of Substance Use Disorder in the last six months (except nicotine)
Pregnancy or lactation
Severe liver dysfunction (LFT 3X upper limit of normal)
Previous known hypersensitivity to tetracyclines
Current treatment with tetracycline or derivative
Treatment with oral contraceptives (unless a second form of birth control is used and documented)
Treatment with cholestyramine or colestipol
Treatment with Urinary alkalinizers (e.g., sodium lactate, potassium citrate)
Treatment with warfarin
Treatment with bupropion, varenicline, or nicotine replacement products in the month prior to study inclusion
Less than two months treatment of adjunctive medications AND less than one month on same dose: beta blockers, antidepressants, mood stabilizers, antianxiety medications.
Medical condition whose pathology or treatment would significantly increase the risk associated with the proposed protocol.
History of head injury, seizures, or stroke
Positive urine toxicology screen for substances of non-therapeutic use prior to craving assessments

Annotated entities:
- Condition: "organic brain disease"
- Temporal: "History of"
- Qualifier: "DSM-IV"
- Condition: "Alcohol Dependence"
- Condition: "Substance Dependence"
- Temporal: "within the last six months"
- Drug: "nicotine"
- Negation: "except"
- Qualifier: "DSM-5"
- Condition: "Substance Use Disorder"
- Temporal: "in the last six months"
- Drug: "nicotine"
- Negation: "except"
- Qualifier: "DSM-IV"
- Condition: "Alcohol Abuse"
- Condition: "Substance Abuse"
- Temporal: "within the last one month"
- Drug: "nicotine"
- Negation: "except"
- Qualifier: "DSM-5"
- Condition: "Substance Use Disorder"
- Temporal: "in the last six months"
- Drug: "nicotine"
- Negation: "except"
- Condition: "Pregnancy"
- Condition: "lactation"
- Condition: "liver dysfunction"
- Qualifier: "Severe"
- Measurement: "LFT"
- Value: "3X upper limit of normal"
- Condition: "hypersensitivity"
- Drug: "tetracyclines"
- Temporal: "Previous"
- Temporal: "Current"
- Procedure: "treatment"
- Drug: "tetracycline"
- Drug: "tetracycline derivative"
- Drug: "oral contraceptives"
- Procedure: "Treatment"
- Observation: "birth control"
- Qualifier: "second form"
- Negation: "unless"
- Drug: "cholestyramine"
- Drug: "colestipol"
- Procedure: "Treatment"
- Procedure: "Treatment"
- Drug: "Urinary alkalinizers"
- Drug: "sodium lactate"
- Drug: "potassium citrate"
- Drug: "warfarin"
- Procedure: "Treatment"
- Drug: "bupropion"
- Drug: "varenicline"
- Drug: "nicotine replacement products"
- Temporal: "in the month prior to study inclusion"
- Reference_point: "study inclusion"
- Procedure: "Treatment"
- Multiplier: "Less than two months"
- Procedure: "treatment"
- Drug: "adjunctive medications"
- Multiplier: "less than one month"
- Multiplier: "same dose"
- Drug: "beta blockers"
- Drug: "antidepressants"
- Drug: "mood stabilizers"
- Drug: "antianxiety medications"
- Condition: "Medical condition"
- Qualifier: "would significantly increase the risk associated with the proposed protocol"
- Condition: "head injury"
- Condition: "seizures"
- Condition: "stroke"
- Temporal: "History"
- Measurement: "urine toxicology screen"
- Qualifier: "substances of non-therapeutic use"
- Value: "Positive"
- Temporal: "prior to craving assessments"
- Reference_point: "craving assessments"